Clinical trial exclusion criterion:
History of alcohol or drug dependence or abuse

Annotated entities:
- Temporal: "History"
- Condition: "alcohol abuse"
- Condition: "drug dependence"
- Condition: "drug abuse"
- Condition: "alcohol dependence"